6. Chest pain lasting longer than 30 minutes within 12 hours pre-procedure, if CK enzymes positive (≥ 2x the normal upper limit).

The above is a clinical trial exclusion criterion. Annotated with entity spans:
6. [Condition: Chest pain] [Qualifier: lasting longer than 30 minutes] [Temporal: within 12 hours pre-procedure], if [Measurement: CK enzymes] [Value: positive] ([Value: ≥ 2x the normal upper limit]).